Clinical trial exclusion criterion:
Liver disease (cirrhosis or liver failure)

Annotated entities:
- Condition: "Liver disease"
- Condition: "liver failure"
- Condition: "cirrhosis"